Clinical trial exclusion criterion:
icterus

Annotated entities:
- Condition: "icterus"